En un estudio farmacoeconómico, el fármaco A produce una esperanza de vida de 5 años con un coste total de 5.000 euros, mientras que el fármaco B produce una esperanza de vida de 6 años con un coste total de 15.000 euros (valores medios por paciente). El criterio de decisión se basa en escoger la intervención más efectiva con un umbral de coste-efectividad de 30.000 euros por año de vida adicional ganado por paciente, ¿qué fármaco es coste-efectivo respecto del otro y por qué?
1. El fármaco B, porque el coste-efectividad incremental con respecto al A está por debajo del umbral de coste-efectividad.
2. El fármaco A, porque cuesta mucho menos que el B y solo hay un año de diferencia en esperanza de vida.
3. El fármaco A, porque el coste-efectividad incremental de B con respecto a A está por encima del umbral de coste-efectividad.
4. El fármaco B, porque cada año de vida tiene un coste de 29.500 euros por debajo del umbral de coste-efectividad.
5. El fármaco A, porque el coste-efectividad incremental con respecto al B está por encima del umbral de coste-efectividad.

Respuesta correcta: 1. El fármaco B, porque el coste-efectividad incremental con respecto al A está por debajo del umbral de coste-efectividad.